Invasive fungal infections in history and at present

The above is a clinical trial exclusion criterion. Annotated with entity spans:
[Qualifier: Invasive] [Condition: fungal infections] in history and at present